Clinical trial exclusion criterion:
Subjects who have been treated over maximum maintenance dose (as specified in each label) of oral antipsychotics at screening. (e.g. Aripiprazole>30mg/day, Olanzapine>20mg/day, Risperidone > 6mg/day, Quetiapine > 750mg/day)

Entity relations:
- Has_multiplier("oral antipsychotics", "maximum maintenance dose")
- Has_value("Aripiprazole", ">30mg/day")
- Has_value("Olanzapine", ">20mg/day")
- Has_value("Risperidone", "> 6mg/day")
- Has_value("Quetiapine", "> 750mg/day")
- Subsumes("oral antipsychotics", "Aripiprazole")
- Has_temporal("oral antipsychotics", "at screening")
- OR("Aripiprazole", "Risperidone", "Olanzapine", "Quetiapine")